Experience with frequent (2-7 times per week) infusions of IgPro20 at the tolerated flow rate of approximately 0.5 mL/min (equivalent of 25-30 mL/h) per injection site for at least 1 month prior to Day 1. The dose (volume) per injection site should not exceed 25 mL.

The above is a clinical trial inclusion criterion. Annotated with entity spans:
Experience with [Qualifier: frequent] ([Multiplier: 2-7 times per week]) infusions of [Drug: IgPro20] at the tolerated flow rate of approximately 0.5 mL/min (equivalent of [Multiplier: 25-30 mL/h]) [Multiplier: per injection site] [Temporal: for at least 1 month prior to Day 1]. The dose (volume) per injection site should [Negation: not] [Multiplier: exceed 25 mL.]